下列何種利尿劑可以用來治療先天性腎性尿崩症（congenital nephrogenic diabetes insipidus）所引起之多尿症？①thiazides ②loop diuretics ③acetazolamide ④amiloride
A. ①②
B. ②③
C. ②④
D. ①④

正確答案：D. ①④